=1 appropriate ICD shocks,

The above is a clinical trial inclusion criterion. Annotated with entity spans:
[Multiplier: =1] appropriate [Procedure: ICD shocks],